What disease is tinea ?

Tinea is a superficial fungal infections of the skin.